Clinical trial inclusion criterion:
American Society of Anesthesiologists Classification I-III

Annotated entities:
- Measurement: "American Society of Anesthesiologists Classification"
- Value: "I-III"